Willing to complete all study visits

The above is a clinical trial inclusion criterion. Annotated with entity spans:
[Post-eligibility: Willing to complete all study visits]